Clinical trial inclusion criterion:
1. Women of childbearing potential must have negative serum (Beta HCG) pregnancy tests performed within 14 days prior to the start of the study and on the evening prior to each dose administration. If dosing is scheduled on Sunday or Monday, the HCG pregnancy test should be given within 48 hours prior to dosing of each study period. An additional serum (Beta HCG) pregnancy test will be performed upon completion of the study.

Annotated entities:
- Person: "Women"
- Condition: "childbearing potential"
- Value: "negative"
- Procedure: "serum pregnancy tests"
- Procedure: "Beta HCG"
- Temporal: "within 14 days prior to the start of the study"
- Reference_point: "the start of the study"
- Temporal: "on the evening prior to each dose administration"
- Reference_point: "each dose administration"